Clinical trial exclusion criterion:
Patients considered to be at risk of bradycardic events (e.g., known sick sinus syndrome or second or third degree atrioventricular [AV)] block) unless already treated with a permanent pacemaker

Entity relations:
- Has_mood("bradycardic events", "at risk of")
- Has_negation("permanent pacemaker", "unless")
- Subsumes("bradycardic events", "sick sinus syndrome")
- AND("bradycardic events", "permanent pacemaker")
- OR("sick sinus syndrome", "third degree atrioventricular [AV)] block", "second degree atrioventricular [AV)] block")